下列有關睡眠呼吸暫停症候群（sleep apnea syndrome）的敘述，何者錯誤？
A. 睡眠期間呼吸出現反覆暫停的現象，發生機率隨著病人的年紀而增加
B. 可能會危及日間的意識狀態以及心血管機能
C. 阻塞型（obstructive type）睡眠呼吸暫停症候群，常有夜間打鼾、過動、多尿以及白天頭痛等病史
D. 中樞型（central type apnea）睡眠呼吸暫停症候群，臨床較為常見而且預後較佳

正確答案：D. 中樞型（central type apnea）睡眠呼吸暫停症候群，臨床較為常見而且預後較佳